Clinical trial exclusion criterion:
History of depression.

Annotated entities:
- Temporal: "History of"
- Condition: "depression"